Richter's syndrome, Burkitt's lymphoma, or Burkitt-like Lymphoma (transformed DLBCL from Follicular NHL are eligible).

The above is a clinical trial exclusion criterion. Annotated with entity spans:
[Condition: Richter's syndrome], [Condition: Burkitt's lymphoma], or [Condition: Burkitt-like Lymphoma] (transformed [Condition: DLBCL] from [Condition: Follicular NHL] are eligible).